下列頭部構造中，何者不會造成疼痛的感覺？
A. 腦底的硬腦膜（dura at brain base）
B. 顱內靜脈竇（venous sinuses）
C. 大腦組織（parenchyma of brain）
D. 中腦膜動脈（middle meningeal artery）

正確答案：C. 大腦組織（parenchyma of brain）